¿Cuál es la ruta biosintética de los terpenos en plantas?:
1. Se sintetizan por la ruta del ácido mevalónico o por la ruta de ácidos grasos.
2. Se sintetizan por la ruta del ácido mevalónico o por la ruta desoxi-xilulosa fosfato (DOXP) también llamada GAP/Piruvato.
3. Se sintetizan por la ruta del mevalónico y la ruta del sikimico.
4. Se sintetizan por la ruta del ácido sikímico o por la ruta desoxi-xilulosa fosfato (DOXP) también llamada GAP/Piruvato.
5. Se sintetizan por la ruta de poliacetatos.

Respuesta correcta: 2. Se sintetizan por la ruta del ácido mevalónico o por la ruta desoxi-xilulosa fosfato (DOXP) también llamada GAP/Piruvato.